Clinical trial exclusion criterion:
Hepatic disease or biliary tract obstruction, or significant hepatic enzyme elevation (alanine transaminase or Aspartate Aminotransferase > 3 times upper limit of normal)

Entity relations:
- Has_qualifier("hepatic enzyme elevation", "significant")
- Has_value("alanine transaminase", "> 3 times upper limit of normal")
- OR("Hepatic disease", "biliary tract obstruction", "hepatic enzyme elevation", "alanine transaminase")
- OR("alanine transaminase", "Aspartate Aminotransferase")